Written informed consent.

The above is a clinical trial inclusion criterion. Annotated with entity spans:
[Observation: Written informed consent].